一位 30 歲原本健康的男性，10 分鐘前還非常清醒，中毒不到 10 分鐘即陷入深度昏迷，下列何種中毒，最不可能導致病人在短時間內昏迷？
A. 氰化物（cyanide）
B. 硫化氫（hydrogen sulfide）
C. 有機磷（organophosphate）
D. 甲醇（methanol）

正確答案：D. 甲醇（methanol）